Apgar score at 5 minutes >7

The above is a clinical trial inclusion criterion. Annotated with entity spans:
[Measurement: Apgar score] [Temporal: at 5 minutes] [Value: >7]